Fulminant hepatic failure.

The above is a clinical trial exclusion criterion. Annotated with entity spans:
[Qualifier: Fulminant] [Condition: hepatic failure].